Patients with chronic obstructive pulmonary disease who are on systemic corticosteroids.

The above is a clinical trial exclusion criterion. Annotated with entity spans:
Patients with [Condition: chronic obstructive pulmonary disease] who are on [Drug: systemic corticosteroids].